45歲女性，乳房摸到腫塊，下列處置何者較恰當？
A. 理學檢查若正常，不需其他檢查，安排半年再追蹤
B. 不需其他檢查，即刻安排手術切除切片
C. 先安排乳房超音波檢查
D. 抽血檢	CA15-3

正確答案：C. 先安排乳房超音波檢查